Is fingolimod a drug or a pro-drug?

FTY720 is a prodrug.